Clinical trial inclusion criteria:
Adult patients (> 18 years) scheduled for cardiopulmonary bypass surgery with Glomerular Filtration Rate (GFR) greater than or equal to 60 and left ventricular ejection fraction greater than or equal to 40%

Annotated entities:
- Person: "Adult"
- Value: "> 18 years"
- Person: "years"
- Procedure: "cardiopulmonary bypass surgery"
- Measurement: "Glomerular Filtration Rate (GFR)"
- Value: "greater than or equal to 60"
- Measurement: "left ventricular ejection fraction"
- Value: "greater than or equal to 40%"
- Mood: "scheduled for"